Clinical trial exclusion criterion:
Known prior stroke or TIA

Entity relations:
- OR("stroke", "TIA")